下列何項不是 non-gallstone pancreatitis 病人住院時的 Ranson's prognostic sign？
A. 年齡 > 55 歲
B. 白血球數目 > 16,000/mm3
C. glucose > 200 mg/100 mL
D. LDH > 150 IU/L

正確答案：D. LDH > 150 IU/L